Clinical trial inclusion criterion:
Patients = 18 years of age

Annotated entities:
- Value: "= 18 years"
- Person: "age"